Clinical trial inclusion criteria:
Type 1 diabetes according to ADA criterias <5 years.
Age= 18 years and less than 70 years.
Non-obese: defined as BMI less than 28 kg/m2
Positive for at least one of the anti-islet autoantibodies: GADA, IA2A, ZnT8A
Fasting or postprandial plasma C-peptide more than 100 pmol/L
Written informed consent from the patient or family representative.

Annotated entities:
- Condition: "Type 1 diabetes"
- Qualifier: "ADA criterias"
- Temporal: "<5 years"
- Person: "Age"
- Value: "= 18 years and less than 70 years"
- Negation: "Non"
- Condition: "obese"
- Measurement: "BMI"
- Value: "less than 28 kg/m2"
- Multiplier: "at least one"
- Condition: "anti-islet autoantibodies"
- Condition: "GADA"
- Condition: "IA2A"
- Condition: "ZnT8A"
- Measurement: "postprandial plasma C-peptide"
- Measurement: "Fasting plasma C-peptide"
- Value: "more than 100 pmol/L"
- Informed_consent: "Written informed consent from the patient or family representative."